Clinical trial exclusion criterion:
Facilities routinely using decolonization

Annotated entities:
- Multiplier: "routinely"
- Procedure: "decolonization"